甲狀腺術後聲音嘶啞（hoarseness），下列何者最可能受傷？
A. 膈神經（phrenic nerve）
B. 喉返神經（recurrent laryngeal nerve）
C. 舌神經（lingual nerve）
D. 舌下神經（hypoglossal nerve）

正確答案：B. 喉返神經（recurrent laryngeal nerve）